untreaed hyperprolactinemia

The above is a clinical trial exclusion criterion. Annotated with entity spans:
[Qualifier: untreaed] [Condition: hyperprolactinemia]